Clinical trial exclusion criterion:
Retransplantation or multiorgan transplantation

Entity relations:
- Has_qualifier("transplantation", "multiorgan")
- OR("Retransplantation", "transplantation")